Hepatic disease

The above is a clinical trial exclusion criterion. Annotated with entity spans:
[Condition: Hepatic disease]